Clinical trial exclusion criterion:
Radiotherapy within 14 days before enrollment (if the involved field is small, 7 days will be considered a sufficient interval between treatment and administration of the ixazomib.)

Annotated entities:
- Procedure: "Radiotherapy"
- Temporal: "within 14 days before enrollment"
- Observation: "involved field is small"
- Temporal: "7 days"